Patients defined by subtype based on 2013 updated phenotypic criteria.

The above is a clinical trial inclusion criterion. Annotated with entity spans:
[Non-representable: Patients defined by subtype based on 2013 updated phenotypic criteria.]